當骨骼肌纖維在做等張收縮時，則下列敘述，何者正確？
A. 肌節縮短及暗帶縮短
B. 肌節縮短及明帶縮短
C. 明帶縮短及暗帶縮短
D. 肌節縮短、暗帶縮短及明帶縮短

正確答案：B. 肌節縮短及明帶縮短